Clinical trial exclusion criterion:
Active hemorrhage or increased risk of bleeding due to impairment of homeostasis.

Annotated entities:
- Condition: "Active hemorrhage"
- Observation: "risk of bleeding"
- Qualifier: "increased"
- Condition: "impairment of homeostasis"